有關肺心症（cor pulmonale）的敘述，下列何者錯誤？
A. 在急性肺心症，右心室明顯肥厚
B. 在急性肺心症，右心室擴張且呈卵圓形
C. 在慢性肺心症，右心室壁增厚
D. 在慢性肺心症，右心室壁的脂肪消失

正確答案：A. 在急性肺心症，右心室明顯肥厚